COPD diagnosed according to GOLD, FEV1 40-80% predicted, SpO2 =92% at 750 m.

The above is a clinical trial inclusion criterion. Annotated with entity spans:
[Condition: COPD] diagnosed according to [Qualifier: GOLD], [Measurement: FEV1] [Value: 40-80% predicted], [Measurement: SpO2] [Value: =92%] at [Qualifier: 750 m].